Clinical trial inclusion criterion:
All patients (excluding neonates) requiring one or more allogeneic RBC transfusions for the treatment of anemia will be included.

Annotated entities:
- Person: "neonates"
- Negation: "excluding"
- Multiplier: "one or more"
- Procedure: "RBC transfusions"
- Qualifier: "allogeneic"
- Condition: "anemia"
- Procedure: "treatment"
- Mood: "requiring"